Neurodegenerative disorders (i.e. Parkinson disease. LBD, or FTD).

The above is a clinical trial exclusion criterion. Annotated with entity spans:
[Condition: Neurodegenerative disorders] (i.e. [Condition: Parkinson disease]. [Condition: LBD], or [Condition: FTD]).